頭部外傷的急救處置應以何者為優先？
A. 胸部X光檢查
B. 檢	尿液
C. 腹部X光檢查
D. 矯正低血壓，維持足夠的供氧

正確答案：D. 矯正低血壓，維持足夠的供氧